Clinical trial exclusion criterion:
Known hypersensitivity to any of the study drugs, including the excipients, or any drugs formulated in polysorbate 80.

Entity relations:
- AND("hypersensitivity", "study drugs")
- OR("study drugs", "drugs formulated in polysorbate 80")